對於大多數的肺臟大細胞癌（Large cell carcinoma），下列敘述何者正確？
A. 會出現角化珠
B. 會形成黏液
C. 為未分化性
D. 等於燕麥細胞癌

正確答案：C. 為未分化性